下列那一種腎臟疾病與 tuberous sclerosis 及皮膚的 angiofibroma 有關？
A. Renal oncocytoma
B. Renal angiomyolipoma
C. Renal fibroma
D. Renal cell carcinoma

正確答案：B. Renal angiomyolipoma